Clinical trial inclusion criterion:
Age ≥ 18 years.

Entity relations:
- Has_value("Age", "≥ 18 years")